Mild male factor infertility or unexplained infertility.

The above is a clinical trial inclusion criterion. Annotated with entity spans:
[Qualifier: Mild] [Condition: male factor infertility] or [Condition: unexplained infertility].